Clinical trial inclusion criterion:
BMI < 32 kg/m2

Annotated entities:
- Measurement: "BMI"
- Value: "< 32 kg/m2"